對於beside surgical procedure的敘述，下列何者錯誤？
A. bedside surgical procedure可針對選擇性的critically ill patients進行手術處理，優點為降低運輸危急病患至
B. bedside laparotomy通常應用於abdominal compartment syndrome，尤其當intra-abdominal pressure達到 grade Ⅲ以上（21mmHg）時，可考慮做此項手術，以減低腹內壓
C. percutaneous dilatational tracheostomy (PDT)對於critically ill patients with prolonged mechanical intubation，是簡單安全的手術，其peri-procedure mortality rate <0.1%
D. percutaneous endoscopic gastrostomy (PEG) 是針對high risk aspiration, inability to swallow, gastric outlet obstruction的critically ill patients,可提供安全快速的腸道管路路徑，灌食營養品

正確答案：D. percutaneous endoscopic gastrostomy (PEG) 是針對high risk aspiration, inability to swallow, gastric outlet obstruction的critically ill patients,可提供安全快速的腸道管路路徑，灌食營養品